有關正常血管（blood vessel）的敘述，下列何者正確？
A. 動脈之外層富含平滑肌細胞
B. 微血管之外層富含纖維細胞（fibroblasts）
C. 內皮細胞（endothelium）可調節血管收縮及放鬆
D. 內皮細胞無法生產一氧化氮（NO）

正確答案：C. 內皮細胞（endothelium）可調節血管收縮及放鬆